在癌症篩檢中常會發生存活率延長的假象，係由何種偏差所造成的？
A. 資訊偏差（Information bias）
B. 選樣偏差（Selection bias）
C. 過度診斷偏差（Overdiagnosis bias）
D. 領先時間偏差（Lead-time bias）

正確答案：D. 領先時間偏差（Lead-time bias）